Clinical trial exclusion criterion:
Moderate/Weak CYP3A inducers such as efavirenz and oxcarbazepine

Annotated entities:
- Drug: "Weak CYP3A inducers"
- Drug: "Moderate CYP3A inducers"
- Drug: "efavirenz"
- Drug: "oxcarbazepine"